Clinical trial exclusion criterion:
Evidence of active infection within 3 days of first dose of 852A

Annotated entities:
- Condition: "active infection"
- Observation: "Evidence"
- Temporal: "within 3 days of first dose"
- Drug: "852A"